Clinical trial inclusion criterion:
Symptoms of ischaemia.

Annotated entities:
- Mood: "Symptoms"
- Condition: "ischaemia"